Pregnant woman.

The above is a clinical trial exclusion criterion. Annotated with entity spans:
[Pregnancy_considerations: Pregnant woman].